HIV regimens containing tenofovir or tipranavir/ritonavir

The above is a clinical trial exclusion criterion. Annotated with entity spans:
[Non-query-able: HIV regimens] containing [Drug: tenofovir] or [Drug: tipranavir/ritonavir]